Cada ciclo de oxidación de los ácidos grasos:
1. Consume dos moléculas de NADH.
2. Genera dos moléculas de FADH2.
3. Produce una deshidratación.
4. Libera un acetil-CoA.
5. Consume ATP.

Respuesta correcta: 4. Libera un acetil-CoA.